20歲苗勒氏管不發育（müllerian agenesis）的女性患者接受腹腔鏡闌尾切除時，外科醫師在骨盆腔發現疑似子宮內膜異位症的病灶，下列何項敘述能合理解釋此情況？
A. 不可能發生子宮內膜異位症，因為沒有子宮的緣故
B. 常常伴隨子宮內膜異位症，因為經血無法排出（menstrual outflow obstruction）的緣故
C. 可能會有子宮內膜異位症，因為經血逆流（retrograde menstruation）的緣故
D. 可能會有子宮內膜異位症，因為體腔上皮異常化生（coelomic metaplasia）的緣故

正確答案：D. 可能會有子宮內膜異位症，因為體腔上皮異常化生（coelomic metaplasia）的緣故